Clinical trial exclusion criterion:
1. High risk profiles for ischemic adverse events such as A. ST-segment elevation myocardial infarction (STEMI) B. Patients with cardiogenic shock or concomitant severe decompensated heart failure C. Myocardial infarction or stent thrombosis in spite of the maintenance of antiplatelet therapy D. Restenosis in stented segments or previous sites of balloon angioplasty 2. Patients who cannot follow allocated DAPT schedule due to the planned surgery or elective procedure within 3 months after the stenting 3. Recent history of major surgery or evident events of gastrointestinal bleeding within 1 month from the procedure 4. Patients on anticoagulation therapy with warfarin or other anticoagulants 5. Life expectancy less than 1 year (such as malignancies or other chronic systemic diseases) 6. Pregnant women 7. Past history of allergy or other contraindications for the following medications/materials: aspirin, clopidogrel, heparin, cobalt chromium, sirolimus

Entity relations:
- AND("High risk profiles", "ischemic adverse events")
- Has_qualifier("heart failure", "decompensated")
- Has_qualifier("heart failure", "severe")
- Subsumes("High risk profiles", "ST-segment elevation myocardial infarction (STEMI)")
- AND("Myocardial infarction", "antiplatelet therapy")
- Has_qualifier("procedure", "elective")
- Has_mood("surgery", "planned")
- Has_temporal("surgery", "within 3 months after the stenting")
- AND("cannot follow allocated DAPT schedule", "surgery")
- Has_temporal("major surgery", "within 1 month from the procedure")
- Has_qualifier("anticoagulants", "other")
- AND("anticoagulation therapy", "warfarin")
- Has_value("Life expectancy", "less than 1 year")
- Has_qualifier("chronic systemic diseases", "other")
- Subsumes("Life expectancy", "malignancies")
- AND("women", "Pregnant")
- Has_qualifier("contraindications", "other")
- AND("contraindications", "allergy")
- AND("contraindications", "aspirin")
- OR("Myocardial infarction", "stent thrombosis")
- OR("ST-segment elevation myocardial infarction (STEMI)", "Restenosis", "heart failure", "cardiogenic shock", "Myocardial infarction")
- OR("surgery", "procedure")
- OR("major surgery", "events of gastrointestinal bleeding")
- OR("warfarin", "anticoagulants")
- OR("malignancies", "chronic systemic diseases")
- OR("aspirin", "cobalt chromium", "heparin", "clopidogrel", "sirolimus")